Subjects who need antipsychotic treatment (other than clozapine), and would be stable when switching to long-acting injectable aripiprazole in the investigator's judgement.

The above is a clinical trial inclusion criterion. Annotated with entity spans:
[Non-representable: Subjects who need antipsychotic treatment (other than clozapine), and would be stable when switching to long-acting injectable aripiprazole in the investigator's judgement.]